Clinical trial exclusion criterion:
Presence of orthodontic devices.

Annotated entities:
- Device: "orthodontic devices"